Clinical trial inclusion criterion:
COPD diagnosed according to GOLD, FEV1 40-80% predicted, SpO2 =92% at 750 m.

Annotated entities:
- Condition: "COPD"
- Qualifier: "GOLD"
- Measurement: "FEV1"
- Value: "40-80% predicted"
- Measurement: "SpO2"
- Value: "=92%"
- Qualifier: "750 m"